Clinical trial exclusion criteria:
Patients who do not meet the inclusion criteria and those who have a history of allergic reactions to human albumin, as well as those who have received iodinated contrast during the 7 days prior to surgery and pregnant women, will be excluded from the study.

Annotated entities:
- Negation: "not"
- Observation: "meet the inclusion criteria"
- Temporal: "history"
- Condition: "allergic"
- Drug: "human albumin"
- Drug: "iodinated contrast"
- Temporal: "during the 7 days prior to surgery"
- Reference_point: "surgery"
- Procedure: "surgery"
- Condition: "pregnant"
- Person: "women"